Clinical trial exclusion criterion:
Previous bladder injection with onabotulinumtoxinA

Entity relations:
- Has_qualifier("onabotulinumtoxinA", "bladder injection")